一位 23 歲酒精成癮患者，經 24 小時停酒後，下列何種情況不太可能出現？
A. 呼吸速率增加至每分鐘 25 次
B. 雙手抖動（tremors）
C. 心跳速率增加為每分鐘 90 次
D. 血壓遽降至 85/55 mmHg

正確答案：D. 血壓遽降至 85/55 mmHg